En el ganglio linfático la mayor parte de los linfocitos T se localizan en:
1. Corteza periférica.
2. Corteza profunda.
3. Cordones medulares.
4. Senos modulares.

Respuesta correcta: 2. Corteza profunda.